Clinical trial exclusion criterion:
Massive hemoptysis defined as > 250 cc in a 24 hour period or 100 cc/day over 4 consecutive days occurring in the two weeks prior to Visit 2

Annotated entities:
- Condition: "hemoptysis"
- Qualifier: "Massive"
- Multiplier: "> 250 cc"
- Temporal: "in a 24 hour period"
- Multiplier: "100 cc/day"
- Temporal: "over 4 consecutive days"
- Temporal: "in the two weeks prior to Visit 2"
- Reference_point: "Visit 2"